Clinical trial exclusion criterion:
Severe chronic insomnia, with reported usual sleep duration <4 hours

Entity relations:
- Has_value("sleep duration", "<4 hours")
- Has_context("chronic insomnia", "sleep duration")